Clinical trial inclusion criterion:
Amenorrhea and FSH> 30mUI/ml according to the criteria of the index subject

Annotated entities:
- Condition: "Amenorrhea"
- Measurement: "FSH"
- Value: "> 30mUI/ml"